Clinical trial inclusion criterion:
Age >/=18 years at screening

Annotated entities:
- Person: "Age"
- Value: ">/=18 years"
- Temporal: "at screening"